Eradication of H. pylori 可造成下列何者的增加？
A. Antral D somatostatin cells
B. Parietal cell mass
C. Mucosa-associated lymphoid tissue
D. Gastrin level

正確答案：A. Antral D somatostatin cells